某些醫療處置可在未取得病人同意之下進行，但何者除外？
A. 在緊急情況下，延遲治療將導致病患死亡
B. 思覺失調症病患有自傷或傷人的情況，需住院治療
C. 疑似伊波拉病毒感染，需隔離治療
D. 唐氏症病患，需住院治療

正確答案：D. 唐氏症病患，需住院治療